Clinical trial exclusion criterion:
BMI <35 and > 60 kg/m2

Entity relations:
- Has_value("BMI", "<35 and > 60 kg/m2")